Clinical trial inclusion criterion:
Planned gynecological lower abdomen surgery with epidural pain treatment

Annotated entities:
- Procedure: "gynecological lower abdomen surgery"
- Mood: "Planned"
- Procedure: "epidural pain treatment"